En la glicólisis:
1. La hexoquinasa cataliza la transferencia de un grupo fosfato a diferentes hexosas.
2. La fosfofructoquinasa-1 cataliza una reacción que proporciona ATP.
3. Todos los intermediarios son compuestos fosforilados de seis carbonos.
4. Proporciona ATP, pero no lo utiliza.
5. La fructosa 2,6-bisfosfato es un potente inhibidor.

Respuesta correcta: 1. La hexoquinasa cataliza la transferencia de un grupo fosfato a diferentes hexosas.